Clinical trial exclusion criteria:
Patients with head trauma or Neurosurgical intervention
Patients <65 years of age
Patients with an expected life expectancy <48 hours
Blind patients
Patients with a seizure history
Patients with uncontrolled hypertension
Patients with a supratheraputic (>3.0) INR
Patients on strong CYP1A2 inhibitors: ciprofloxacin, fluvoxamine, methoxsalen, ofloxacin, primaquine
Patients who do not speak English or Spanish

Annotated entities:
- Condition: "head trauma"
- Procedure: "Neurosurgical intervention"
- Value: "<65 years"
- Person: "age"
- Observation: "expected life expectancy"
- Value: "<48 hours"
- Condition: "Blind"
- Condition: "seizure"
- Temporal: "history"
- Condition: "uncontrolled hypertension"
- Value: "supratheraputic"
- Value: ">3.0"
- Measurement: "INR"
- Drug: "ciprofloxacin"
- Drug: "fluvoxamine"
- Drug: "methoxsalen"
- Drug: "ofloxacin"
- Drug: "primaquine"
- Drug: "strong CYP1A2 inhibitors"
- Negation: "not"
- Observation: "speak English"
- Observation: "speak Spanish"